50 歲的陳先生是位網球愛好者，他最近為了準備公司企業盃網球賽，連續 2 週密集參加網球集訓。結果他發覺肘關節外側疼痛，特別是手部用力握拳、或是腕部用力向背側屈曲（wrist extension）這些動作，症狀特別嚴重。陳先生最可能傷到那條肌腱？
A. 橈側屈腕肌（flexor carpi radialis muscle）
B. 深屈指肌（flexor digitorum profundus muscle）
C. 橈側伸腕短肌（extensor carpi radialis brevis muscle）
D. 旋前圓肌（pronator teres muscle）

正確答案：C. 橈側伸腕短肌（extensor carpi radialis brevis muscle）